Clinical trial exclusion criterion:
Any lung surgery within the past two years.

Annotated entities:
- Procedure: "lung surgery"
- Temporal: "within the past two years"